Clinical trial exclusion criterion:
Known or suspected infections that are severe, life threatening or are not included in the ABSSSI Food and Drug Administration (FDA) guidance

Entity relations:
- Has_qualifier("infections", "severe")
- Has_qualifier("infections", "life threatening")